Clinical trial inclusion criterion:
The study will include 40 post-deep peel women (exoderm), older than 18 years old, treated by the same dermatologist (dr. Landau).

Entity relations:
- Subsumes("deep peel", "exoderm")
- Has_value("old", "older than 18 years")